What is the protective efficacy of vaxchora against moderate to severe cholera?

The protective efficacy of vaxchora  against moderate to severe cholera is 80-100%.